Clinical trial inclusion criterion:
Failed previous fusion

Annotated entities:
- Procedure: "fusion"
- Qualifier: "Failed"
- Temporal: "previous"